Clinical trial inclusion criterion:
Chronic Heart failure subjects with medical history of cardiac disease or other related cardiovascular disease.

Annotated entities:
- Condition: "Chronic Heart failure"
- Condition: "cardiac disease"
- Condition: "cardiovascular disease"
- Qualifier: "related"